下列何者不是成對的構造？
A. 橫竇（transverse sinus）
B. 上岩竇（superior petrosal sinus）
C. 枕竇（occipital sinus）
D. 海綿竇（cavernous sinus）

正確答案：C. 枕竇（occipital sinus）